Females 18-65 years old who undergoing colposcopic directed biopsy

The above is a clinical trial inclusion criterion. Annotated with entity spans:
[Person: Females] [Value: 18-65 years] [Person: old] who [Temporal: undergoing] [Procedure: colposcopic directed biopsy]